known diabetes

The above is a clinical trial exclusion criterion. Annotated with entity spans:
known [Condition: diabetes]